Clinical trial exclusion criteria:
Dementia.
Gastroscopy planned at the same time.
Allergies to propofol
All cases were a 'full stomach' is suspected (gastric banding)
Pregnancy

Annotated entities:
- Condition: "Dementia"
- Procedure: "Gastroscopy"
- Mood: "planned"
- Temporal: "at the same time"
- Condition: "Allergies"
- Drug: "propofol"
- Non-representable: "All cases were a 'full stomach' is suspected (gastric banding)"
- Condition: "Pregnancy"